一位 70 歲男性病人因嗜睡、臉色蒼白，並有輕微心跳加快，被送到急診處就診。周邊血液檢查：血色素及血容積比明顯下降，平均紅血球體積（MCV）增加，有巨血小板及多葉嗜中性球。臨床上，下列那一因素的缺乏最常見？
A. 嗜鈷蛋白（Cobalophilin）
B. 胃	蛋白	酶（Pepsin）
C. 內在因素（Intrinsic factor）
D. 鈷胺傳遞蛋白（Transcobalamin）

正確答案：C. 內在因素（Intrinsic factor）